Clinical trial inclusion criterion:
BMI < 32 kg/m2

Entity relations:
- Has_value("BMI", "< 32 kg/m2")